有關肝包蟲囊（Hydatid cyst of liver）之治療的敘述，下列何者錯誤？
A. 以手術切除或引流為主
B. 以藥物治療如 Albendazole 可達 20%至 30%之療效
C. 某些個案可以經皮穿刺引流囊腫，達到治療之目的
D. 無症狀之囊腫，不須接受治療

正確答案：D. 無症狀之囊腫，不須接受治療